急性間質性肺炎與下列那一項較無關？
A. 吸入毒氣
B. 過敏性反應
C. 病毒性感染
D. 吸入胃部內含異物

正確答案：D. 吸入胃部內含異物